Clinical trial exclusion criterion:
Chronic pain disorders

Annotated entities:
- Condition: "Chronic pain"